8. Allergy or hypersensitivity to metformin hydrochloride. 9. History of difficulty in swallowing medication, or any gastrointestinal disorder which could affect the drug absorption.

The above is a clinical trial exclusion criterion. Annotated with entity spans:
[Parsing_Error: 8.] [Condition: Allergy] or [Condition: hypersensitivity] to [Drug: metformin hydrochloride]. [Parsing_Error: 9.] [Temporal: History] of [Condition: difficulty in swallowing medication], or any [Condition: gastrointestinal disorder] which could [Qualifier: affect the drug absorption].